Which proteins act as histone-like molecules in prokaryotes?

THe histone-like proteins HU, IHF, H-NS (Nucleoid Structuring) act as histones in prokaryotes